Clinical trial inclusion criterion:
Allograft functioning at an acceptable level as defined by the AST, ALT, Total Bilirubin levels =3 times ULN prior to enrollment.

Entity relations:
- Has_value("AST", "=3 times ULN")
- Has_value("Allograft functioning", "acceptable level")
- Subsumes("Allograft functioning", "AST")
- Has_temporal("Allograft functioning", "prior to enrollment")
- Has_value("ALT", "=3 times ULN")
- Has_value("Total Bilirubin", "=3 times ULN")
- AND("AST", "ALT")
- AND("ALT", "Total Bilirubin")